Las estructuras de los cromosomas condensados se mantiene mediante:
1. Topoisomerasas.
2. Proteínas del nucléolo.
3. Fragmentos de Okazaky.
4. Proteínas SMC.
5. Proteína DNMT1.

Respuesta correcta: 4. Proteínas SMC.